一位50歲左右的男性，雙手因無名指、小指屈曲攣縮影響功能來求診，手掌可摸到纖維性索條（fibrous cord）及變厚的皮膚，但無麻痺現象，下列何者正確？
A. 可能是正中神經麻痺（median nerve palsy）
B. 手術無法治癒
C. 好發於女性
D. 可能是尺神經麻痺（ulnar nerve palsy）

正確答案：B. 手術無法治癒